下列何種藥物在肝臟的快速代謝，何者與肝血流量（blood flow-limited）無關？
A. Alprenolol
B. Lidocaine
C. Isoniazid
D. Aspirin

正確答案：D. Aspirin